Clinical trial exclusion criterion:
Any other confounding bladder or urethral pathology, including urethral stricture, bladder neck contracture, or bladder atonia

Annotated entities:
- Condition: "urethral pathology"
- Undefined_semantics: "urethral pathology"
- Condition: "urethral stricture"
- Condition: "bladder neck contracture"
- Condition: "bladder atonia"
- Condition: "bladder pathology"
- Undefined_semantics: "bladder pathology"